Clinical trial inclusion criterion:
Chronic Insomnia disorder criteria according to the criteria of DMS- V ( American Psychiatric Association, 2013) and insomnia severity index > 15

Annotated entities:
- Condition: "Chronic Insomnia disorder"
- Qualifier: "criteria of DMS- V"
- Measurement: "insomnia severity index"
- Value: "> 15"